¿Cuál de los siguientes déficits puede dar lugar a una hiperquilomicronemia?:
1. Apo A-I y Apo A-II.
2. Apo C-II.
3. Apo B-100.
4. Receptor de LDL.

Respuesta correcta: 2. Apo C-II.